Receiving warfarin or other oral anticoagulant

The above is a clinical trial exclusion criterion. Annotated with entity spans:
Receiving [Drug: warfarin] or [Qualifier: other] [Condition: oral anticoagulant]